Clinical trial exclusion criterion:
A lower respiratory tract infection within 7 days of the screening visit.

Annotated entities:
- Condition: "lower respiratory tract infection"
- Temporal: "within 7 days of the screening visit"
- Reference_point: "screening visit"